El control de la enfermedad acidopéptica se consigue fundamentalmente con IBP (inhibidores de la bomba de protones). Los IBP:
1. Inducen al máximo de inhibición de la secreción gástrica a los 3-5 días.
2. Son menos eficaces que los antagonistas H-2.
3. Se usan como monoterapia para erradicar el Helicobacter pylori.
4. Presentan un inicio de acción más rápido que los antagonistas H-2.
5. No son de utilidad en el tratamiento de las úlceras por estrés.

Respuesta correcta: 1. Inducen al máximo de inhibición de la secreción gástrica a los 3-5 días.